調節型T細胞（Treg cells）在人類的自體免疫疾病的致病機轉及調控方面，有何角色？
A. 在紅斑性狼瘡疾患（systemic lupus erythematosus, SLE），抑制初始淋巴球（naïve lymphocytes）之歸處（homing）
B. 在多發性硬化症（multiple sclerosis）疾患，呈現功能缺失現象
C. 在類風濕性關節炎（rheumatoid arthritis）疾患，呈現功能過高現象
D. 在人類的自體免疫疾病的致病機轉方面，並無角色

正確答案：B. 在多發性硬化症（multiple sclerosis）疾患，呈現功能缺失現象